Clinical trial exclusion criterion:
Medication which affect glycemic control

Entity relations:
- AND("affect glycemic control", "Medication")